下列何者不是鐵質沈著症之臨床表現？
A. 肝臟腫大
B. 皮膚黑色素沈著過多
C. 血糖過高
D. 性腺功能過高

正確答案：D. 性腺功能過高